十二指腸近幽門處潰瘍造成出血，可結紮下列那條血管以便止血？
A. 肝總動脈（common heaptic artery）
B. 下胰十二指腸動脈（inferior pancreaticoduodenal artery）
C. 左胃動脈（left gastric artery）
D. 左胃網膜動脈（left gastroomental artery）

正確答案：A. 肝總動脈（common heaptic artery）